Presence of a left ventricular assist device

The above is a clinical trial exclusion criterion. Annotated with entity spans:
Presence of a [Device: left ventricular assist device]